Clinical trial inclusion criterion:
15 weeks 0 days gestational age - 23 weeks 5 days gestational age at time of dilator insertion

Entity relations:
- Has_value("gestational age", "15 weeks 0 days - 23 weeks 5 days")
- Has_index("at time of dilator insertion", "dilator insertion")
- Has_temporal("gestational age", "at time of dilator insertion")